下列何種情況會刺激DNA合成所需酵素的生成，進而使細胞週期從G1期進入S期？
A. p53蛋白質被活化
B. p21蛋白質大量產生
C. CDK2磷酸化retinoblastoma protein（pRb）
D. 形成pRb-E2F複合體

正確答案：C. CDK2磷酸化retinoblastoma protein（pRb）